List all clinical trials of the polypill.

'Use of a Multidrug Pill In Reducing cardiovascular Events' (UMPIRE) trial, European Clinical Trials database, as EudraCT: 2009-016278-34 and the Clinical Trials Registry, India as CTRI/2010/091/000250.
'IMProving Adherence using Combination Therapy (IMPACT)', Australian New Zealand Clinical Trial Registry (ACTRN12606000067572).
'Kanyini Guidelines Adherence with the Polypill (Kanyini-GAP)'
Phase II study of the Polycap, double-blind, randomised trial, registered with ClinicalTrials.gov, number NCT00443794
Second Indian Polycap Study, TIPS-2
Cluster Randomized Usual Care vs Caduet Investigation Assessing Long-term-risk (CRUCIAL trial)
GEMINI trial, 14-week, open-label trial conducted in 1220 patients from the USA
GEMINI-Australia, Asia, Latin America, Africa/Middle East (AALA) study 
JEWEL study program, with JEWEL 1 conducted among 1138 patients from the UK and Canada and JEWEL 2 conducted in 1107 patients from Europe
CAPABLE54, the Clinical Utility of Caduet in Simultaneously Achieving Blood Pressure and Lipid End Points , in the USA
CUSP (The Caduet® in an Untreated Subject Population trial)
TOGETHER trial
A randomised controlled trial in seven countries – Australia, Brazil, India, Netherlands , New Zealand , United Kingdom  and United States.   Australian New Zealand Clinical Trials Registry (ACTRN 12607000099426)